11. Stroke still requiring neurological rehabilitation.

The above is a clinical trial exclusion criterion. Annotated with entity spans:
[Parsing_Error: 11.] [Condition: Stroke] still [Non-query-able: requiring] [Procedure: neurological rehabilitation].